Clinical trial exclusion criteria:
Other neuromuscular disease
Contraindication to weight bearing on lower extremities
Pressure sores where harness would be applied
Uncontrollable hypotension when upright
Lower limb contractures impeding range of motion necessary for ambulation
Prior enrolment in a BWATT program
Unable to commit to intervention for duration of protocol

Annotated entities:
- Condition: "neuromuscular disease"
- Observation: "weight bearing on lower extremities"
- Condition: "Contraindication"
- Condition: "Pressure sores"
- Device: "harness"
- Condition: "hypotension"
- Qualifier: "Uncontrollable"
- Qualifier: "when upright"
- Condition: "Lower limb contractures"
- Mood: "impeding"
- Observation: "range of motion necessary for ambulation"
- Non-representable: "Prior enrolment in a BWATT program"
- Post-eligibility: "Unable to commit to intervention for duration of protocol"